Clinical trial inclusion criterion:
Patients with reduced ejection fraction (= 40%) as confirmed at any time point in the patient's medical history.

Entity relations:
- Has_value("ejection fraction", "= 40%")